對於子宮內膜癌 FIGO 分期為 stage Ib G3 期的病人，最常使用的術後治療計畫為何？
A. 小心追蹤檢查
B. 放射線治療
C. 黃體素治療
D. 化學療法

正確答案：B. 放射線治療